Clinical trial inclusion criterion:
Clinical indication for statins for primary or secondary prevention of cardiovascular disease or dyslipidaemia, on either no medication or non-statin lipid lowering therapy (e.g, ezetimibe)

Annotated entities:
- Condition: "indication"
- Drug: "statins"
- Observation: "prevention of cardiovascular disease"
- Qualifier: "secondary"
- Qualifier: "primary"
- Condition: "dyslipidaemia"